一位 55 歲女性主訴，早上做家事時突發劇烈頭痛，並有短暫的喪失意識，醒來後仍有類似要爆裂的頭痛加上嘔吐，同時有畏光和頸部僵硬情形，理學檢查發現右側動眼神經麻痺以及明顯腦膜徵兆 （meningismus），綜合以上發現最可能的診斷為：
A. 腦動脈瘤破裂出血
B. 腦動靜脈畸型破裂出血
C. 中大腦動脈栓塞
D. 高血壓性腦內血腫（Hypertensive intracranial hematoma）

正確答案：A. 腦動脈瘤破裂出血